Healthy Volunteers

The above is a clinical trial exclusion criterion. Annotated with entity spans:
[Parsing_Error: Healthy Volunteers]